History of symptomatic congestive heart failure, or ventricular arrhythmia requiring treatment.

The above is a clinical trial exclusion criterion. Annotated with entity spans:
History of [Qualifier: symptomatic] [Condition: congestive heart failure], or [Condition: ventricular arrhythmia] [Qualifier: requiring treatment].